Clinical trial exclusion criterion:
11. Sexually active women of childbearing age who do not use an acceptable barrier method of birth control

Entity relations:
- Has_value("age", "childbearing")
- Has_negation("barrier method of birth control", "not")
- Has_qualifier("barrier method of birth control", "acceptable")